Clinical trial exclusion criterion:
supplemental oxygen requirement (< 3 months)

Annotated entities:
- Procedure: "supplemental oxygen"
- Mood: "requirement"
- Temporal: "< 3 months"